Infection with hepatitis C Virus

The above is a clinical trial exclusion criterion. Annotated with entity spans:
[Condition: Infection] with [Qualifier: hepatitis C Virus]